一位 28 歲女性，主訴 3 天前開始出現腹痛。病人無噁心嘔吐，食慾正常，排便習慣沒變。陰道分泌物增多，但無出血現象。有固定吃避孕藥，不曾懷孕。理學檢查發現體溫為 38.5℃，下腹部有壓痛（tenderness），但無反彈痛（rebounding pain），腸音正常。若懷疑此病人是婦科或腸道疾病，以下敘述何者最為適當？
A. 因為有發燒而且有吃避孕藥，所以此病人不可能是子宮外孕
B. 腹腔鏡（laparoscopy）可用來診斷骨盆腔感染（pelvic inflammatory disease）
C. 骨盆腔感染最常見的病原為金黃色葡萄球菌（Staphylococcus aureus）
D. 若做理學檢查發現有明顯子宮頸移動痛（cervical motion tenderness）或子宮旁附屬器疼痛（adnexal tenderness），則可排除闌尾炎的可能性

正確答案：B. 腹腔鏡（laparoscopy）可用來診斷骨盆腔感染（pelvic inflammatory disease）